有關胰島素（insulin）基因所合成的前激素原（preprohormone）之敘述，下列何者錯誤？
A. 胰島素的前激素原必須在內質網（endoplasmic reticulum）合成
B. 胰島素之A鏈或B鏈分別由兩個基因轉錄轉譯而來
C. 胰島素由多胜肽前驅物經蛋白裂解（proteolytic cleavage）產生
D. 合成後進入分泌顆粒

正確答案：B. 胰島素之A鏈或B鏈分別由兩個基因轉錄轉譯而來